Clinical trial inclusion criteria:
1. PPROM with gestational age between 27 to 34 weeks
2. Cephalic presentation
3. Clear amniotic fluid
4. Oral temperature > 38 C
5. Near distance from the hospital (the patient can reach hospital within one hour )
6. Home environment safe and amenable to rest , availability of family support such as a sister or mother who will help the patient at home .
7. Maternal and fetal condition remain stable after hospitalization for 72 hours

Annotated entities:
- Parsing_Error: "1."
- Measurement: "gestational age"
- Value: "between 27 to 34 weeks"
- Condition: "PPROM"
- Parsing_Error: "2."
- Condition: "Cephalic presentation"
- Parsing_Error: "3."
- Observation: "Clear amniotic fluid"
- Parsing_Error: "4."
- Measurement: "Oral temperature"
- Value: "> 38 C"
- Parsing_Error: "5."
- Post-eligibility: "Near distance from the hospital (the patient can reach hospital within one hour )"
- Non-query-able: "Near distance from the hospital (the patient can reach hospital within one hour )"
- Parsing_Error: "6."
- Non-query-able: "Home environment safe and amenable to rest , availability of family support such as a sister or mother who will help the patient at home ."
- Subjective_judgement: "Home environment safe and amenable to rest , availability of family support such as a sister or mother who will help the patient at home ."
- Parsing_Error: "7."
- Condition: "fetal condition"
- Condition: "Maternal condition"
- Qualifier: "stable"
- Temporal: "after hospitalization for 72 hours"
- Reference_point: "hospitalization"